血清中出現下列何種標記，代表病人對 B 型肝炎病毒具有免疫力？
A. IgM-anti-HBc
B. IgG-anti-HBc
C. anti-HBe
D. anti-HBs

正確答案：D. anti-HBs